Ladd's procedure 是下列何種疾病的手術方式？
A. 小腸閉鎖（intestinal atresia）
B. 無肛症（imperforate anus）
C. 小腸複製畸型（intestinal duplication）
D. 小腸扭轉不全（malrotation）

正確答案：D. 小腸扭轉不全（malrotation）